下列有關圓盤性狼瘡（Discoid lupus erythematosus）的敘述，何者錯誤？
A. 男性病患多於女性
B. 好發於臉部與頭皮
C. 病理下可見表皮層萎縮與基底膜（basement membrane zone）增厚
D. 患者宜減少陽光的曝曬或使用防曬用品

正確答案：A. 男性病患多於女性